Patients are known to have impaired liver function, evidenced by ALT values within normal limits, and no previous liver disease.

The above is a clinical trial exclusion criterion. Annotated with entity spans:
Patients are known to have [Value: impaired] [Measurement: liver function], evidenced by [Measurement: ALT values] [Value: within normal limits], and [Negation: no] [Temporal: previous] [Condition: liver disease].